Clinical trial inclusion criterion:
Age between one year and 18 years

Annotated entities:
- Person: "Age"
- Value: "between one year and 18 years"